Clinical trial exclusion criterion:
Erectile dysfunction in the history or current medication for erectile dysfunction

Annotated entities:
- Condition: "Erectile dysfunction"
- Temporal: "history"
- Drug: "medication"
- Temporal: "current"
- Condition: "erectile dysfunction"